ANC = 1.5 × 109 / L

The above is a clinical trial inclusion criterion. Annotated with entity spans:
[Measurement: ANC] [Value: = 1.5 × 109 / L]